Willing to return for follow up Visit 3

The above is a clinical trial inclusion criterion. Annotated with entity spans:
[Mood: Willing to] return for [Procedure: follow up Visit 3]